micturition problems,

The above is a clinical trial exclusion criterion. Annotated with entity spans:
[Condition: micturition] problems,